下列關於胃上皮細胞之敘述，何者錯誤？
A. mucous cell 負責分泌胃黏液、第二型胃蛋白酶原（pepsinogen II）及碳酸氫鹽（bicarbonate）
B. chief cell 負責分泌第一、二型胃蛋白酶原（pepsinogen I and II）
C. 細胞內粒線體（mitochondria）含量最多的細胞是 parietal cell，負責分泌胃酸、內在因子（intrinsic factor）
D. 內分泌細胞（endocrine cell），包含負責分泌胃泌素（gastrin）的 G 細胞及分泌 histamine 的 D 細胞

正確答案：D. 內分泌細胞（endocrine cell），包含負責分泌胃泌素（gastrin）的 G 細胞及分泌 histamine 的 D 細胞